The potential postoperative visual acuity of 20/40 or better in both eyes;

The above is a clinical trial inclusion criterion. Annotated with entity spans:
[Non-query-able: The potential postoperative visual acuity of 20/40 or better in both eyes;]